Clinical trial exclusion criterion:
Received an investigational or non-registered medicinal product within 30 days prior to informed consent.

Annotated entities:
- Qualifier: "investigational"
- Qualifier: "non-registered"
- Drug: "medicinal product"
- Temporal: "within 30 days prior to informed consent"
- Reference_point: "informed consent"